Clinical trial inclusion criterion:
Participant aged 19 or over

Annotated entities:
- Person: "aged"
- Value: "19 or over"